評估腦性麻痺患者的肢體痙攣，發現被動性關節活動度正常，但是整個活動範圍當中都有顯著增加的肌肉張力，這是屬於 Modified Ashworth Scale 的第幾級？
A. 第 1 級
B. 第 1+級
C. 第 2 級
D. 第 3 級

正確答案：C. 第 2 級